Clinical trial exclusion criterion:
osteoarticular, neuromuscular or cognitive limitation that prevents ambulation

Entity relations:
- Has_negation("ambulation", "prevents")
- OR("osteoarticular limitation", "neuromuscular limitation", "cognitive limitation")